Clinical trial inclusion criterion:
Women with singleton pregnancy.

Annotated entities:
- Person: "Women"
- Condition: "singleton pregnancy"